Clinical trial exclusion criteria:
Dual organ or kidney after another solid organ transplant
Presence of a preexisting significant GI condition that does not have a presumed causal relationship with MPA
Evidence of any GI disorder induced by an infection, underlying medical condition, or concomitant medication other than MPA
eGFR<40 ml/min at time of possible conversion
Proteinuria >1 gram/day at time of possible conversion
Hemoglobin <10 g/dL
WBC <3 K/cumm
Platelets <100 K/cumm
Wound healing issues at time of possible conversion (eg, wound dehiscence, wound infection, incisional hernia, lymphocele, seroma)
Elevated total cholesterol (>350 mg/dL) and/or triglycerides (>500 ng/dL) at time of possible conversion
Hypersensitivity to everolimus, sirolimus, or other rapamycin deriviatives

Annotated entities:
- Procedure: "solid organ transplant"
- Condition: "Dual organ"
- Condition: "Dual kidney"
- Condition: "GI condition"
- Temporal: "preexisting"
- Qualifier: "significant"
- Condition: "GI disorder"
- Qualifier: "induced by an infection"
- Condition: "infection"
- Condition: "underlying medical condition"
- Drug: "medication"
- Drug: "MPA"
- Negation: "other than"
- Measurement: "eGFR"
- Value: "<40 ml/min"
- Temporal: "at time of possible conversion"
- Measurement: "Proteinuria"
- Value: ">1 gram/day"
- Temporal: "at time of possible conversion"
- Measurement: "Hemoglobin"
- Value: "<10 g/dL"
- Measurement: "WBC"
- Value: "<3 K/cumm"
- Measurement: "Platelets"
- Value: "<100 K/cumm"
- Condition: "Wound healing issues"
- Temporal: "at time of possible conversion"
- Condition: "wound dehiscence"
- Condition: "wound infection"
- Condition: "incisional hernia"
- Condition: "lymphocele"
- Condition: "seroma"
- Measurement: "total cholesterol"
- Value: "Elevated"
- Value: ">350 mg/dL"
- Measurement: "triglycerides"
- Value: ">500 ng/dL"
- Temporal: "at time of possible conversion"
- Condition: "Hypersensitivity"
- Drug: "everolimus"
- Drug: "sirolimus"
- Drug: "rapamycin"